Which drugs are included in the VIFUP regimen for breast cancer?

ViFuP includes vinorelbine, cisplatin and continuous infusion of 5-fluorouracil.